一位 14 歲國中女生有脊椎側彎症，X 光片顯示其最大彎曲點在第一腰椎且柯卜氏角度（Cobb's angle）為 30 度。下列何者為最主要的矯治方式？
A. 給予脊椎背部運動治療
B. 給予脊椎牽拉（traction）治療
C. 給予矯正用塑膠成型背架
D. 脊椎手術矯正治療

正確答案：C. 給予矯正用塑膠成型背架